Clinical trial inclusion criteria:
American Society of Anesthesiologists Classification I-III
Normal cognitive function in order to sign written, informed consent and to understand trial protocol
Agreement to the trial protocol, including the randomized manner

Annotated entities:
- Measurement: "American Society of Anesthesiologists Classification"
- Value: "I-III"
- Post-eligibility: "ormal cognitive function in order to sign written, informed consent and to understand trial protoco"
- Post-eligibility: "Agreement to the trial protocol, including the randomized manner"